Patients undergoing laparoscopic or robotic colorectal resections

The above is a clinical trial inclusion criterion. Annotated with entity spans:
Patients undergoing [Qualifier: laparoscopic] or [Qualifier: robotic] [Procedure: colorectal resections]